Clinical trial exclusion criterion:
Patients with severe and/or uncontrolled concurrent medical disease that in the opinion of the investigator could cause unacceptable safety risks or compromise compliance with the protocol.

Entity relations:
- Has_temporal("medical disease", "concurrent")
- Has_qualifier("medical disease", "severe")
- OR("severe", "uncontrolled")